Clinical trial exclusion criterion:
Age <18 years old

Annotated entities:
- Person: "Age"
- Value: "<18 years old"